Patient is unwilling to discontinue alpha blockers 1 month after study treatment

The above is a clinical trial exclusion criterion. Annotated with entity spans:
[Non-query-able: Patient is unwilling to discontinue alpha blockers 1 month after study treatment]